Clinical trial inclusion criteria:
Scheduled back surgery

Annotated entities:
- Mood: "Scheduled"
- Procedure: "back surgery"